What is the function of emergency granulopoiesis?

During 'emergency' situations such as infections, host defense requires rapid mobilization of bone marrow granulocyte progenitors . Granulopoiesis is tightly regulated to meet host demands during both "steady-state" and "emergency" situations, such as infection . It promotes neutrophil-dendritic cell encounters that prevent mouse lung allograft acceptance .